有關藥物動力學的敘述，下列何者正確？
A. 鹼性藥物較酸性藥物，易由胃部吸收
B. 在血液中鹼性藥物較酸性藥物，易與白蛋白結合
C. 鹼性藥物較酸性藥物，易由乳汁排出
D. 由腎臟排出時，鹼性藥物較酸性藥物，易由腎小管再吸收回到血液中

正確答案：C. 鹼性藥物較酸性藥物，易由乳汁排出